以下何者不是Krukenberg tumor常見的原發腫瘤部位？
A. 大腸（colon）
B. 肺（lung）
C. 胃（stomach）
D. 乳房（breast）

正確答案：B. 肺（lung）